TDF to TAF/TAF-containing fixed-dose combination regimens

The above is a clinical trial inclusion criterion. Annotated with entity spans:
[Drug: TDF] to [Drug: TAF]/[Procedure: TAF-containing fixed-dose combination regimens]